Age <1m or > 24 months of age

The above is a clinical trial exclusion criterion. Annotated with entity spans:
[Person: Age] [Value: <1m or > 24 months of age]